食道弛緩不能（esophageal achalasia）的標準診斷工具為食道張力測試，關於esophageal achalasia之食道張力測試的診斷發現，下列何者錯誤？
A. 食道無正常之蠕動（peristalsis）
B. 下食道括約肌（lower esophageal sphinter，LES）無正常之放鬆
C. 食道的蠕動壓力過高
D. 下食道括約肌（lower esophageal sphinter，LES）壓力過高

正確答案：C. 食道的蠕動壓力過高